Clinical trial exclusion criterion:
Steroids other than methylprednisolone or prednisone

Entity relations:
- Has_negation("methylprednisolone", "other than")
- AND("Steroids", "methylprednisolone")
- OR("methylprednisolone", "prednisone")